Clinical trial inclusion criterion:
ASA physical status 1 or 2

Entity relations:
- Has_value("ASA physical status", "1")
- OR("1", "2")